Si la madre presenta infección por varicela durante la gestación ¿Cuándo existe un riesgo mayor de que el niño desarrolle una varicela fulminante?:
1. Cuando la infección se presenta entre el primer y segundo trimestre de gestación.
2. Cuando la infección se presenta entre el segundo trimestre y los 21 días anteriores al parto.
3. Cuando la infección se presenta entre los 20 y los 6 días anteriores al parto.
4. Cuando la infección se presenta entre los 5 días anteriores al parto y los 2 días posteriores al mismo.

Respuesta correcta: 4. Cuando la infección se presenta entre los 5 días anteriores al parto y los 2 días posteriores al mismo.